吳先生被送至醫院急診時，主訴為腹脹併腹絞痛兩天，當天並有嘔吐現象，過去兩天吳先生未排便但有排氣。身體診查體溫 37.5℃，心跳速率每分鐘 102 下，呼吸速率每分鐘 18 下，血壓 130/60 mmHg。腹部診查顯示有右腹部壓痛、反彈痛及右下腹闌尾切除術後疤痕。經抽血檢查及輸液補充，腹部 X 光攝影顯示有小腸阻塞現象，於是進一步安排腹部電腦斷層檢查。則有關腹部電腦斷層檢查的敘述，下列何者錯誤？
A. 此時電腦斷層檢查通常須配合喝水溶性顯影劑（water soluble contrast）
B. 電腦斷層檢查中，水溶性顯影劑在 24 小時內出現在大腸顯影，可作為腸阻塞緩解的指標
C. 水溶性顯影劑可以降低需要手術的機會
D. 水溶性顯影劑可以降低住院天數

正確答案：C. 水溶性顯影劑可以降低需要手術的機會